Clinical trial exclusion criterion:
Comorbidities such as uncontrolled cardiovascular disease, i.e., unstable systemic arterial hypertension, coronary artery disease; previous stroke; OSA; pneumothorax in the last 2 months.

Entity relations:
- Has_qualifier("cardiovascular disease", "uncontrolled")
- Has_qualifier("stroke", "previous")
- Has_qualifier("systemic arterial hypertension", "unstable")
- AND("cardiovascular disease", "systemic arterial hypertension")
- Has_temporal("pneumothorax", "in the last 2 months")
- Subsumes("Comorbidities", "cardiovascular disease")
- OR("systemic arterial hypertension", "coronary artery disease")
- OR("cardiovascular disease", "stroke", "OSA", "pneumothorax")